Clinical trial inclusion criterion:
history of any stroke, transient ischemic attack or intracranial bleeding

Annotated entities:
- Condition: "stroke"
- Condition: "transient ischemic attack"
- Condition: "intracranial bleeding"